What is known about the effect of acupuncture in smoking cessation ?

Ear acupressure (EAP) and ear acupuncture have been used for smoking cessation, and some positive results have been reported.
Auricular (ear) acupressure has been purported to be beneficial in achieving smoking cessation in some studies, while in others has been deemed insignificant.
The combined acupuncture-education group showing the greatest effect from treatment.